Clinical trial exclusion criterion:
Primary groups: Vaccination against typhoid fever within 5 years before dosing.

Entity relations:
- multi("Vaccination against typhoid fever", "typhoid fever")
- Has_index("within 5 years before dosing", "dosing")
- Has_temporal("Vaccination against typhoid fever", "within 5 years before dosing")
- AND("Primary groups", "Vaccination against typhoid fever")